Clinical trial exclusion criterion:
Known hypersensitivity to ACE inhibitors

Annotated entities:
- Condition: "hypersensitivity to ACE inhibitors"
- Drug: "ACE inhibitors"